Clinical trial exclusion criterion:
Previous therapy of PWS within the last 4 weeks;

Annotated entities:
- Temporal: "Previous"
- Procedure: "therapy"
- Temporal: "within the last 4 weeks"
- Condition: "PWS"